妊娠時，母親血清中「甲型胎兒蛋白（AFP）」過高時，應懷疑下列何種疾病？
A. 染色體異常，尤其是唐氏症
B. 胎兒神經管缺損或皮膚有缺損
C. 海洋性貧血
D. 妊娠滋養層細胞疾病

正確答案：B. 胎兒神經管缺損或皮膚有缺損